Clinical trial exclusion criterion:
Patients taking psychotropic medications or illicit drugs that may alter cognition, concentration, or behavior. Appropriate treatment by a licensed provider with medications for depression or anxiety, including but not limited to SSRIs, SNRIs, and standard dose benzodiazepines at a stable dose, is permitted

Entity relations:
- AND("psychotropic medications", "alter cognition")
- OR("alter cognition", "alter behavior", "alter concentration")
- OR("psychotropic medications", "illicit drugs")